Known history of non-compliance to treatment.

The above is a clinical trial exclusion criterion. Annotated with entity spans:
[Non-query-able: Known history of non-compliance to treatment].